下列何者不是支氣管擴張症做單純肺葉切除手術適應症？
A. 病人內科治療失	合併反覆肺炎
B. 反覆咳血影響正常生活
C. 雙側嚴重支氣管擴張症
D. 侷限型單肺葉支氣管擴張症

正確答案：C. 雙側嚴重支氣管擴張症